Clinical trial exclusion criterion:
Hypertension diagnosis

Annotated entities:
- Condition: "Hypertension"